關於纖維薄層型肝細胞癌（fibrolamellar carcinoma），下列敘述何者錯誤？
A. 好發於年輕人
B. 背景肝臟通常已有嚴重纖維化或肝硬化
C. 腫瘤細胞為含有許多粒線體的oncocytes，由緻密的纖維帶分開
D. 通常預後較好

正確答案：B. 背景肝臟通常已有嚴重纖維化或肝硬化